Clinical trial exclusion criterion:
Patients on strong CYP1A2 inhibitors: ciprofloxacin, fluvoxamine, methoxsalen, ofloxacin, primaquine

Annotated entities:
- Drug: "ciprofloxacin"
- Drug: "fluvoxamine"
- Drug: "methoxsalen"
- Drug: "ofloxacin"
- Drug: "primaquine"
- Drug: "strong CYP1A2 inhibitors"